Clinical trial exclusion criterion:
Preference for one of the treatment options

Annotated entities:
- Non-representable: "Preference for one of the treatment options"